Clinical trial exclusion criterion:
Abnormal 12-lead electrocardiogram (ECG) at screening or pre-dose (Day -1 or Day 1), except minor deviations deemed to be of no clinical significance by the Investigator.

Annotated entities:
- Procedure: "12-lead electrocardiogram (ECG)"
- Value: "Abnormal"
- Temporal: "at screening"
- Temporal: "at pre-dose"
- Reference_point: "screening"
- Reference_point: "pre-dose"
- Temporal: "Day -1"
- Temporal: "Day 1"